Clinical trial exclusion criterion:
abnormal liver function tests (AST/ALT > 43 U/L), liver disease, viral hepatitis, hepatitis B virus (HBV) infection

Entity relations:
- Has_value("liver function tests", "abnormal")
- Subsumes("liver function tests", "AST")
- Has_value("AST", "> 43 U/L")
- OR("AST", "ALT")
- OR("liver function tests", "viral hepatitis", "hepatitis B virus (HBV) infection", "liver disease")